De los fármacos reseñados, ¿Cuál de ellos se utiliza en el tratamiento profiláctico de la migraña?:
1. Dihidroergotamina.
2. Meperidina.
3. Flunarizina.
4. Clorpromazina.
5. Sumatriptán.

Respuesta correcta: 3. Flunarizina.